Myocardial infarct, cerebrovascular accident, sepsis, respiratory failure, or severe intercurrent illness within the previous 6 weeks

The above is a clinical trial exclusion criterion. Annotated with entity spans:
[Condition: Myocardial infarct], [Condition: cerebrovascular accident], [Condition: sepsis], [Condition: respiratory failure], or [Qualifier: severe] [Condition: intercurrent illness] [Temporal: within the previous 6 weeks]